allergy to to local anesthetics

The above is a clinical trial exclusion criterion. Annotated with entity spans:
[Condition: allergy] to to [Drug: local anesthetics]